Clinical trial inclusion criteria:
Patients scheduled for thyroidectomy with general anesthesia in the University of Chile Clinical Hospital

Annotated entities:
- Mood: "scheduled for"
- Procedure: "thyroidectomy"
- Procedure: "general anesthesia"
- Visit: "University of Chile Clinical Hospita"